Clinical trial inclusion criterion:
Primary or secondary amenorrhea for more than three months with LH and FSH> 30mUI/ml

Entity relations:
- Has_qualifier("amenorrhea", "Primary")
- Has_value("LH", "> 30mUI/ml")
- Has_temporal("Primary", "for more than three months")
- Has_value("FSH", "> 30mUI/ml")
- OR("Primary", "secondary")